Congenital Cyanotic heart disease

The above is a clinical trial exclusion criterion. Annotated with entity spans:
[Qualifier: Congenital] [Condition: Cyanotic heart disease]